• Disease-modifying anti-rheumatic drugs (30 days off drug)

The above is a clinical trial exclusion criterion. Annotated with entity spans:
• [Drug: Disease-modifying anti-rheumatic drugs] ([Temporal: 30 days off drug])